Clinical trial exclusion criterion:
Hypersensitivity to everolimus, sirolimus or excipient

Annotated entities:
- Condition: "Hypersensitivity"
- Drug: "everolimus"
- Drug: "sirolimus"
- Drug: "excipient"